下列有關skin graft之敘述，何者錯誤？
A. skin graft的存活需要經過plasmatic circulation、organization and revascularization
B. 最常見手術失	的原因是hematoma or seroma accumulation、infection and movement
C. graft dermis越厚愈會contracture
D. plasmatic circulation是指在術後48小時內graft直接吸收養分

正確答案：C. graft dermis越厚愈會contracture